Any medical condition requiring, or likely to require chronic systemic administration of steroids, during the course of the study

The above is a clinical trial exclusion criterion. Annotated with entity spans:
Any medical condition requiring, or likely to require [Qualifier: chronic] [Drug: systemic] administration of steroids, [Temporal: during the course of the study]